做吞嚥功能檢查時，請病人說 "la-la-la" 是在檢測：
A. 口唇功能
B. 舌頭功能
C. 聲帶功能
D. 軟腭功能

正確答案：B. 舌頭功能